(1)Completed MTHFR C677T gene polymorphism detection in run-in period or MTHFR C677T genotype already known in advance;

The above is a clinical trial inclusion criterion. Annotated with entity spans:
(1)Completed [Qualifier: MTHFR C677T] [Procedure: gene polymorphism detection] in run-in period or [Qualifier: MTHFR C677T] [Observation: genotype already known] in advance;